Clinical trial inclusion criterion:
Stage IA or IIA disease

Annotated entities:
- Non-representable: "Stage IA or IIA disease"